Can not cooperate with the treatment

The above is a clinical trial exclusion criterion. Annotated with entity spans:
Can [Negation: not] [Observation: cooperate with the treatment]